Clinical trial exclusion criterion:
Undifferentiated adenocarcinoma.

Entity relations:
- Has_qualifier("adenocarcinoma", "Undifferentiated")